Clinical trial inclusion criterion:
Patient is receiving or scheduled to receive chemotherapy within 30 days before or after the procedure

Annotated entities:
- Procedure: "chemotherapy"
- Mood: "is receiving"
- Mood: "scheduled to receive"
- Temporal: "within 30 days before or after the procedure"
- Reference_point: "the procedure"